Legally mandated to participate in treatment

The above is a clinical trial exclusion criterion. Annotated with entity spans:
[Non-query-able: Legally mandated to participate in treatment]